下列何種疾病或原因所導致的黃疸，以直接型高膽紅素血症（Conjugated hyperbilirubinemia）為主？
A. ABO血型不合溶血（ABO incompatibility hemolysis ）
B. 溶血性尿毒症（Hemolytic-uremic syndrome）
C. Alagille症候群（Alagille syndrome）
D. Gilbert症候群（Gilbert syndrome）

正確答案：C. Alagille症候群（Alagille syndrome）